Severe hepatic dysfunction (Child-Pugh class C) or severe renal dysfunction (requirement of renal replacement therapy before surgery);

The above is a clinical trial exclusion criterion. Annotated with entity spans:
[Qualifier: Severe] [Condition: hepatic dysfunction] ([Measurement: Child-Pugh] [Value: class C]) or [Qualifier: severe] [Condition: renal dysfunction] (requirement of [Procedure: renal replacement therapy] [Temporal: before surgery]);